Current acute decompensated heart failure (exacerbation of chronic heart failure manifested by signs and symptoms that may require intravenous therapy).

The above is a clinical trial exclusion criterion. Annotated with entity spans:
Current [Qualifier: acute] [Qualifier: decompensated] [Condition: heart failure] ([Condition: exacerbation] of [Condition: chronic heart failure] manifested by [Condition: signs] and [Condition: symptoms] that may require [Procedure: intravenous therapy]).